Critically ill patients (typically admitted to the intensive care unit)

The above is a clinical trial inclusion criterion. Annotated with entity spans:
[Condition: Critically ill] patients ([Mood: typically] [Procedure: admitted] to the [Visit: intensive care unit])